What drug cures hepatitis C?

Sofosbuvir-based therapy cures hepatitis C virus infection